Clinical trial inclusion criterion:
2. Available for all visits and consent to follow all procedures scheduled for the study

Annotated entities:
- Post-eligibility: "Available for all visits and consent to follow all procedures scheduled for the study"